Clinical trial exclusion criterion:
10. Presence of an active systemic or local cancer or tumor of any kind (with the exception of non-melanoma skin cancer)

Annotated entities:
- Parsing_Error: "10."
- Condition: "local cancer"
- Condition: "systemic cancer"
- Temporal: "active"
- Condition: "tumor of any kind"
- Condition: "non-melanoma skin cancer"
- Negation: "with the exception of"